Clinical trial inclusion criterion:
Has at least one measurable lesion based on RECIST version 1.1 as determined by investigator

Annotated entities:
- Multiplier: "at least one"
- Condition: "lesion"
- Measurement: "RECIST version 1.1"
- Value: "measurable"